Indique la respuesta correcta:
1. El sistema nervioso entérico consiste en el plexo submucoso y en el mientérico.
2. El plexo mientérico tiene neuronas sensoriales y motoras.
3. El plexo mientérico regula los movimientos de la mucosa y la secreción de glándulas y el plexo submucoso regula la motilidad gástrica.
4. 1 y 2 son correctas.
5. Todas son correctas.

Respuesta correcta: 4. 1 y 2 son correctas.